Clinical trial inclusion criterion:
Children, aged between one and 24 months. classified as (American Society of Anesthesiologists) ASA physical status I or II, undergoing TEE were enrolled in the study.

Annotated entities:
- Person: "Children"
- Person: "aged"
- Value: "between one and 24 months"
- Measurement: "American Society of Anesthesiologists"
- Measurement: "ASA physical status"
- Value: "I or II"
- Procedure: "TEE"